Clinical trial inclusion criterion:
PSA = 20 ng/ml

Annotated entities:
- Measurement: "PSA"
- Value: "= 20 ng/ml"